Willing and able to comply with the study procedures and provide written informed consent to participate in the study

The above is a clinical trial inclusion criterion. Annotated with entity spans:
[Non-query-able: Willing and able to comply with the study procedures and provide written informed consent to participate in the study]